Clinical trial inclusion criterion:
3. The subject will have been on insulin pump therapy for at least 3 months and currently using a fast actin insulin analog (Lispro, Aspart or Guilisine).

Entity relations:
- Has_temporal("insulin pump therapy", "for at least 3 months")
- Subsumes("fast actin insulin analog", "Lispro")
- Has_temporal("fast actin insulin analog", "currently")
- OR("Lispro", "Aspart", "Guilisine")